Clinical trial exclusion criterion:
Women who are pregnant (as evidenced by pregnancy test if pre-menopausal)

Annotated entities:
- Pregnancy_considerations: "Women who are pregnant (as evidenced by pregnancy test if pre-menopausal)"